Symptomatic paroxysmal AF who had at least one AF episode electrocardiographically documented within one (1) year prior to enrollment. Documentation may include electrocardiogram (ECG); Transtelephonic monitoring (TTM), Holter monitor or telemetry strip

The above is a clinical trial inclusion criterion. Annotated with entity spans:
[Qualifier: Symptomatic] [Condition: paroxysmal AF] who had [Multiplier: at least one] [Condition: AF episode] [Qualifier: electrocardiographically documented] [Temporal: within one (1) year prior to enrollment]. Documentation may include [Procedure: electrocardiogram (ECG)]; [Procedure: Transtelephonic monitoring (TTM)], [Procedure: Holter monitor] or [Procedure: telemetry strip]